Adequate heart function

The above is a clinical trial inclusion criterion. Annotated with entity spans:
[Condition: Adequate heart function]